Clinical trial exclusion criterion:
Person who weighs more than 136kg.

Entity relations:
- Has_value("weighs", "more than 136kg")